provision of informed consent

The above is a clinical trial inclusion criterion. Annotated with entity spans:
[Informed_consent: provision of informed consent]